Excepto en los pacientes cuyo fracaso renal crónico sea debido a nefropatía diabética o a nefropatía túbulo-intersticial, el patrón de gasometría arterial que usted esperaría encontrar en un paciente con fracaso renal crónico sería:
1. pH 7.30, HCO3 18 mEq/L, Cl 116 mg/dL, porque es característica la acidosis metabólica con anión gap normal.
2. pH 7.46, HCO3 18 mEq/L, Cl 116 mg/dL, porque es característica la alcalosis metabólica hiperclorémica.
3. pH 7.456, HCO3 18 mEq/L, Cl 100 mg/dL, porque es característica la acidosis metabólica con anión gap aumentado.
4. pH 7.46, HCO3 30 mEq/L, Cl 90 mg/dL, porque es característica la alcalosis metabólica con anión gap normal.
5. pH 7.45, HCO3 23 mEq/L, Cl 100 mg/dL, porque es característica la alcalosis metabólica con anión gap normal.

Respuesta correcta: 3. pH 7.456, HCO3 18 mEq/L, Cl 100 mg/dL, porque es característica la acidosis metabólica con anión gap aumentado.